The virus that causes FIP, Feline Infectious Peritonitis belongs to what family?

Feline Infectious Peritonitis (FIP) belongs to the family of coronavirus.